下列何種腎臟替代療法為末期腎病之最佳治療（treatment of choice）？
A. 血液透析（hemodialysis）
B. 腹膜透析（peritoneal dialysis）
C. 腎臟移植（kidney transplantation）
D. 血液過濾透析（hemodiafiltration）

正確答案：C. 腎臟移植（kidney transplantation）